Scheduled for arthroscopic labral repair with or without osteoplasty of the hip.

The above is a clinical trial inclusion criterion. Annotated with entity spans:
[Mood: Scheduled] for [Procedure: arthroscopic labral repair] with or without [Procedure: osteoplasty] of the [Qualifier: hip].